你目睹一位約30歲女性跳河自殺，經救起後發現無意識與呼吸，於是開始幫她做心肺復甦術 （cardiopulmonary resuscitation）。依照2010版美國心臟醫學會指引（American Heart 
 Association guidelines），做心肺復甦術時胸部按壓與吹氣做幾個循環後需再確認脈搏？
A. 5個循環
B. 10個循環
C. 隨時可再確認
D. 待病人有呼吸時

正確答案：A. 5個循環